下列有關阿米巴之敘述中，何者錯誤？
A. 利用PCR技術可鑑別痢疾阿米巴（Entamoeba histolytica）及迪斯帕阿米巴（Entamoeba dispar）
B. Metronidazole為痢疾阿米巴症之首選治療藥物
C. 痢疾阿米巴（Entamoeba histolytica）的滋養體（trophozoites）會吞噬紅血球
D. 人體寄生性阿米巴之寄生部位均在大腸

正確答案：D. 人體寄生性阿米巴之寄生部位均在大腸